小芬預定兩週後去緬甸賑災，她上行政院衛生署疾病管制局網站，網站建議需使用瘧疾預防性用藥，網站上說明 Chloroquine 及 Mefloquine 當地皆有抗藥性，則最好的處置是下列何者？
A. 不需給予藥物
B. 只需衛教即可
C. 依病人情況給予 Doxycycline 或 Malarone（Atovaquone/proguanil）
D. 依病人情況給予 Chloroquine 或 Mefloquine

正確答案：C. 依病人情況給予 Doxycycline 或 Malarone（Atovaquone/proguanil）